Clinical trial exclusion criterion:
Patients who do not speak English or Spanish

Entity relations:
- Has_negation("speak English", "not")
- OR("speak English", "speak Spanish")